八歲女孩因溺水接受急救後送至加護病房，呈完全昏迷狀態三天且無自行呼吸，必須完全仰賴呼吸器及其他生命支持系統。家屬同意器官捐贈移植，但需要判定腦死後才能實施。若病童有下列那一項徵兆，則絕對無法判為腦死？
A. 瞳孔完全放大對光無反應
B. 有 doll eye sign
C. 血氧濃度正常
D. 體溫正常

正確答案：B. 有 doll eye sign